Clinical trial exclusion criterion:
Subject has been diagnosed with active hepatitis, AIDS, or HIV.

Entity relations:
- Has_qualifier("hepatitis", "active")
- OR("hepatitis", "HIV", "AIDS")